Clinical trial exclusion criteria:
Endoscopically confirmed gastric and/or duodenal ulcers on Day 1.
Endoscopically confirmed active upper gastrointestinal hemorrhage on Day 1.
Current or past history of aspirin-induced asthma or hypersensitivity to NSAIDs.
Past or planned surgery affecting gastric acid secretion.
Clinically significant hepatic or renal disorder.
Serious cardiac dysfunction, hypertension, or hematological disorder.

Annotated entities:
- Qualifier: "Endoscopically confirmed"
- Procedure: "Endoscopically"
- Condition: "gastric"
- Condition: "duodenal ulcers"
- Temporal: "on Day 1"
- Reference_point: "Day 1"
- Qualifier: "Endoscopically confirmed"
- Procedure: "Endoscopically"
- Condition: "upper gastrointestinal hemorrhage"
- Temporal: "active"
- Temporal: "on Day 1"
- Reference_point: "Day 1"
- Qualifier: "aspirin-induced"
- Drug: "aspirin"
- Condition: "asthma"
- Condition: "hypersensitivity to NSAIDs"
- Drug: "NSAIDs"
- Temporal: "past history"
- Temporal: "Current"
- Qualifier: "affecting gastric acid secretion"
- Procedure: "surgery"
- Mood: "planned"
- Temporal: "Past"
- Condition: "renal disorder"
- Condition: "hepatic disorder"
- Qualifier: "Clinically significant"
- Subjective_judgement: "Clinically significant"
- Condition: "cardiac dysfunction"
- Condition: "hypertension"
- Condition: "hematological disorder"
- Qualifier: "Serious"
- Subjective_judgement: "Serious"